La miastenia grave en un ejemplo de enfermedad causada por:
1. Anticuerpos específicos.
2. Inmunocomplejos.
3. Citocinas.
4. Linfocitos T citotóxicos.

Respuesta correcta: 1. Anticuerpos específicos.